El ciclopentadieno es tan reactivo que dejándolo a temperatura ambiente dimeriza lentamente por una reacción de:
1. Friedel-Crafts.
2. Diels-Alder.
3. Markonikov.
4. Suzuki.
5. Gabriel.

Respuesta correcta: 2. Diels-Alder.